Clinical trial inclusion criterion:
Subject must have a diagnosis of COPD based on the American Thoracic Society (ATS)/ European Respiratory Society (ERS) criteria.

Annotated entities:
- Condition: "COPD"
- Measurement: "American Thoracic Society (ATS)/ European Respiratory Society (ERS) criteria"